下列那種疾病是自殺最主要的危險因子？
A. 末期癌症
B. 憂鬱症
C. 毒癮
D. 適應障礙

正確答案：B. 憂鬱症